關於檢查輸卵管因子所引起不孕症的敘述，何者錯誤？
A. 輸卵管攝影結果為近端輸卵管阻塞，會建議再做一次輸卵管攝影
B. 輸卵管攝影檢查通常在月經週期的第 16 到 21 天之間執行
C. 若兩側輸卵管嚴重水腫，會建議先將輸卵管阻斷或切除後，再做試管嬰兒
D. 做輸卵管攝影檢查，建議吃預防性抗生素

正確答案：B. 輸卵管攝影檢查通常在月經週期的第 16 到 21 天之間執行